Clinical trial exclusion criterion:
Seriously-ill patients with hypotension/capillary leak/life threatening bleeding.

Annotated entities:
- Condition: "Seriously-ill"
- Condition: "hypotension"
- Condition: "capillary leak"
- Qualifier: "life threatening"
- Condition: "bleeding"